Clinical trial exclusion criterion:
Obstructive or restrictive pulmonary disease

Entity relations:
- OR("Obstructive pulmonary disease", "restrictive pulmonary disease")